A positive scrub typhus RDT (Scrub Typhus IgM RDT, InBios International, Seattle, WA, USA) and/or positive PCR-based detection of O. tsutsugamushi DNA from the admission blood sample

The above is a clinical trial inclusion criterion. Annotated with entity spans:
A [Value: positive] [Measurement: scrub typhus RDT] ([Procedure: Scrub Typhus IgM RDT], InBios International, Seattle, WA, USA) and/or [Value: positive] [Procedure: PCR]-based detection of [Qualifier: O. tsutsugamushi DNA] from the [Qualifier: admission blood sample]